Known hypersensitivity to study drug (ferric carboxymaltose or equivalent) or its excipients

The above is a clinical trial exclusion criterion. Annotated with entity spans:
Known [Condition: hypersensitivity] to [Drug: study drug] ([Drug: ferric carboxymaltose] or equivalent) or its excipients